non-type 1 diabetes mellitus

The above is a clinical trial exclusion criterion. Annotated with entity spans:
[Condition: non-type 1 diabetes mellitus]